La acción antiepiléptica de la vigabatrina (gamma-vinilGABA) se debe a que:
1. Es un inhibidor suicida de la GABAtransaminasa.
2. Es un agonista del receptor de GABA.
3. Es un análogo duro del GABA.
4. Es un profármaco del GABA.

Respuesta correcta: 1. Es un inhibidor suicida de la GABAtransaminasa.